Clinical trial inclusion criterion:
American Society of Anaesthesiologists (ASA) 2 and stable ASA 3 patients

Annotated entities:
- Measurement: "American Society of Anaesthesiologists"
- Measurement: "ASA"
- Value: "2"
- Measurement: "ASA"
- Value: "3"
- Qualifier: "stable"